Clinical trial exclusion criterion:
Creatinine level >1.5 mg/dL or dependence on dialysis

Entity relations:
- Has_value("Creatinine level", ">1.5 mg/dL")
- OR("Creatinine level", "dialysis")